Clinical trial inclusion criterion:
Respiratory culture(s) demonstrating evidence of Pseudomonas aeruginosa or Achromobacter species airway infection.

Annotated entities:
- Measurement: "Respiratory culture(s)"
- Value: "Pseudomonas aeruginosa"
- Value: "Achromobacter species"
- Condition: "airway infection"